Clinical trial inclusion criterion:
Treated with either diet alone, any combination of oral antidiabetic agents, non-insulin injectables or insulin therapy

Annotated entities:
- Procedure: "diet"
- Drug: "oral antidiabetic agents"
- Drug: "insulin"
- Drug: "non-insulin injectables therapy"